Clinical trial inclusion criterion:
Unilateral leg pain secondary to lateral stenosis, disc protrusion or herniated disc.

Annotated entities:
- Condition: "Unilateral leg pain"
- Condition: "lateral stenosis"
- Condition: "disc protrusion"
- Condition: "herniated disc"